Cuál de los intermediarios siguientes puede aislarse en las levaduras que fermentan vino y no en el músculo sano:
1. Lactato.
2. Acetaldehído.
3. Acetil CoA.
4. Citrato.
5. Oxalacetato.

Respuesta correcta: 2. Acetaldehído.